Clinical trial inclusion criterion:
C-reactive protein > 15 mg/l (three fold higher than the upper limit of normal)

Entity relations:
- Subsumes("> 15 mg/l", "three fold higher than the upper limit of normal")
- Has_value("C-reactive protein", "> 15 mg/l")